Clinical trial exclusion criterion:
Life expectancy of less than one year

Entity relations:
- Has_value("ife expectancy", "less than one year")